¿Cuál es el vector de la fiebre amarilla?:
1. Phlebotomus longipalpis.
2. Aedes aegypti.
3. Simulium damnosum.
4. Xenopsylla cheopis.

Respuesta correcta: 2. Aedes aegypti.